Clinical trial exclusion criterion:
History of any major internal disease (including diabetes, cardiovascular disease, lung disease, liver or kidney disease);

Entity relations:
- Subsumes("major internal disease", "diabetes")
- OR("diabetes", "cardiovascular disease", "lung disease", "kidney disease", "liver disease")